Clinical trial inclusion criterion:
Adult patient being referred for clinically indicated positron emission tomography myocardial perfusion imaging at the Centre hospitalier de l'Université de Montréal

Entity relations:
- AND("positron emission tomography myocardial perfusion imaging", "Centre hospitalier de l'Université de Montréal")
- Has_qualifier("positron emission tomography myocardial perfusion imaging", "clinically indicated")